Clinical trial exclusion criterion:
ASA IV

Annotated entities:
- Measurement: "ASA"
- Value: "IV"